Patients with current diagnosis of primary cutaneous ALCL (patients whose ALCL has transformed to sALCL are eligible).

The above is a clinical trial exclusion criterion. Annotated with entity spans:
Patients with current diagnosis of [Condition: primary cutaneous ALCL] (patients whose ALCL has transformed to [Condition: sALCL] are eligible).